List characteristics of Developmental and Epileptic Encephalopathies (DEEs).

Developmental and epileptic encephalopathies (DEEs) are severe neurodevelopmental disorders often beginning in infancy or early childhood that have poor prognosis. DEEs are characterized by intractable seizures, abundant epileptiform activity on EEG, and developmental impairment or regression.